Clinical trial inclusion criterion:
Overweight and obese PCOS patients with newly diagnosed IGR;

Annotated entities:
- Condition: "Overweight"
- Condition: "obese"
- Condition: "PCOS"
- Temporal: "newly diagnosed"
- Condition: "IGR"